Severe hepatic or renal failure

The above is a clinical trial exclusion criterion. Annotated with entity spans:
[Qualifier: Severe] [Condition: hepatic] or [Condition: renal failure]